Clinical trial inclusion criterion:
Subject is 65 years or older on the day of surgery

Entity relations:
- multi("the day of surgery", "surgery")
- Has_index("on the day of surgery", "the day of surgery")
- Has_value("older", "65 years or older")
- Has_temporal("65 years or older", "on the day of surgery")